Clinical trial exclusion criterion:
Hormone Replacement Therapy or oral contraceptive usage

Entity relations:
- OR("Hormone Replacement Therapy", "oral contraceptive")